Subject has a life expectancy of less than three (3) years.

The above is a clinical trial exclusion criterion. Annotated with entity spans:
Subject has a [Observation: life expectancy] of [Value: less than three (3) years].